Clinical trial exclusion criterion:
Patients pregnant or lactating.

Annotated entities:
- Pregnancy_considerations: "Patients pregnant or lactating"